Clinical trial exclusion criterion:
psychosomatic or psychiatric diseases requiring hospitalization during the last 12 months

Entity relations:
- Has_temporal("hospitalization", "last 12 months")
- OR("psychosomatic diseases", "psychiatric diseases")